Clinical trial exclusion criterion:
Evidence of abnormal liver function (serum ALT level(s) > 5 times upper limit of normal at screening or creatinine levels >2 times upper limit of normal at screening);

Entity relations:
- Has_value("serum ALT level(s)", "> 5 times upper limit of normal")
- Has_temporal("serum ALT level(s)", "at screening")
- Has_value("creatinine levels", ">2 times upper limit of normal")
- Has_temporal("creatinine levels", "at screening")
- Has_value("liver function", "abnormal")
- Subsumes("liver function", "serum ALT level(s)")
- OR("serum ALT level(s)", "creatinine levels")